Clinical trial inclusion criterion:
GOLD 1: FEV1=0.80 and FEV1/FVC < 0.70

Entity relations:
- Has_value("GOLD", "1")
- Has_value("FEV1/FVC", "< 0.70")
- Has_value("FEV1", "=0.80")
- Subsumes("GOLD", "FEV1")